Clinical trial exclusion criterion:
Patient is unwilling to discontinue alpha blockers 1 month after study treatment

Entity relations:
- Has_index("1 month after study treatment", "study treatment")